Dietary restrictions that would prohibit the consumption of standardized meals

The above is a clinical trial exclusion criterion. Annotated with entity spans:
[Condition: Dietary restrictions] that [Qualifier: would prohibit the consumption of standardized meals]